Cases (with a history of TBI):

The above is a clinical trial inclusion criterion. Annotated with entity spans:
[Parsing_Error: Cases (with a history of TBI):]